Desde un punto de vista del control del crecimiento microbiano, se puede afirmar que:
1. La pasteurización es un método de esterilización para sustancias líquidas.
2. La sobrepresión es la que mata a los microorganismos cuando se utiliza el autoclave.
3. Los agentes antisépticos se aplican sobre tejidos vivos.
4. El autoclave es el método recomendado para esterilizar líquidos termosensibles.
5. El uso de la radiación ultravioleta se debe a su elevado poder de penetración.

Respuesta correcta: 3. Los agentes antisépticos se aplican sobre tejidos vivos.